Clinical trial exclusion criterion:
Any patient whose condition will not allow for placement of the electrode PadSet.

Entity relations:
- AND("placement", "electrode PadSet")
- Has_mood("placement", "allow")
- Has_negation("allow", "not")
- AND("condition", "placement")